Early, intermediate, advanced, non metastatic Hepatocellular Carcinoma. Indication for radioembolization validated after pluridisciplinary committee meeting.

The above is a clinical trial inclusion criterion. Annotated with entity spans:
[Qualifier: Early], [Qualifier: intermediate], [Qualifier: advanced], [Negation: non] [Qualifier: metastatic] [Condition: Hepatocellular Carcinoma]. [Observation: Indication] for [Procedure: radioembolization] [Non-query-able: validated after pluridisciplinary committee meeting].